Clinical trial exclusion criterion:
Concurrent medication limiting validity of neuropsychological tests or imaging.

Entity relations:
- AND("Concurrent", "medication")
- Has_qualifier("Concurrent", "limiting validity of neuropsychological tests")
- OR("limiting validity of neuropsychological tests", "limiting validity of imaging")